Patient meets ONE of the following criteria: baseline PSA < 4.0ng/mL (no prostate biopsy required) OR baseline PSA >/= 4 ng/mL AND a negative prostate biopsy (minimum 12 core biopsy) within the prior 12 months

The above is a clinical trial inclusion criterion. Annotated with entity spans:
Patient meets ONE of the following criteria: [Temporal: baseline] [Measurement: PSA] [Value: < 4.0ng/mL] (no prostate biopsy required) OR [Temporal: baseline] [Measurement: PSA] [Value: >/= 4 ng/mL] AND a [Value: negative] [Measurement: prostate biopsy] ([Multiplier: minimum 12] [Procedure: core biopsy]) [Temporal: within the prior 12 months]